Clinical trial exclusion criterion:
Airway or thoracic malformation

Entity relations:
- OR("Airway malformation", "thoracic malformation")